En un ensayo clínico se evaluó la no-inferioridad del inhalador HDP-MDI (experimental) frente al inhalador FDC-ELIPTUS (control). El límite clínicamente relevante inferior se fijó en -50 ml en el volumen espiratorio forzado en el primer segundo (VEF1). Los resultados mostraron una diferencia absoluta en VEF1 entre tratamientos de +8 mL a favor del inhalador HDP-MDI (intervalo de confianza al 95%: -59 ml a +67 ml). Señale la respuesta CORRECTA:
1. El nuevo inhalador HDP-MDI es superior al inhalador control.
2. El inhalador FDC-ELIPTUS es no-inferior al inhalador experimental.
3. El estudio no es concluyente.
4. Ambos inhaladores son equivalentes.
5. El inhalador HDP-MDI es no-inferior al inhalador control.

Respuesta correcta: 3. El estudio no es concluyente.